Clinical trial inclusion criterion:
Second trimester pregnancy.

Entity relations:
- Has_qualifier("pregnancy", "Second trimester")
- multi("Second trimester", "Second trimester")